有關腸黏膜中 lamina propria 與上皮細胞之間的免疫細胞成分之敘述，下列何者正確？
A. lamina propria主要以CD8+T細胞為主
B. 上皮細胞之間的免疫細胞主要為 NK T 細胞
C. 樹突細胞只在 lamina propria 出現，並不會直接接觸腸道的細菌
D. 嗜中性白血球較少出現在腸黏膜中，但是遇到感染時會很快遷移至發炎處

正確答案：D. 嗜中性白血球較少出現在腸黏膜中，但是遇到感染時會很快遷移至發炎處